下列那一項不是腮腺炎（mumps）的合併症？
A. 睪丸炎（orchitis）
B. 胰臟炎（pancreatitis）
C. 感染後腦炎（postinfectious encephalitis）
D. 進行性多灶性白質腦病（progressive multifocal leukoencephalopathy）

正確答案：D. 進行性多灶性白質腦病（progressive multifocal leukoencephalopathy）